芬坦尼貼片（Fentanyl patch）常使用於癌症疼痛控制，但很少用於手術後之疼痛控制主要是因為：
A. 當停止使用芬坦尼貼片止痛藥效急遽消失
B. 腸阻塞（Ileus）和耐受性（Tolerance）的發生比 Morphine 還快
C. 到達血中止痛濃度需 10 到 12 小時之後且呼吸抑制作用於手術後之疼痛控制難以預測
D. 臨床上控制手術後疼痛所需 Fentanyl 之劑量太高

正確答案：C. 到達血中止痛濃度需 10 到 12 小時之後且呼吸抑制作用於手術後之疼痛控制難以預測